Clinical trial exclusion criterion:
Schedule of procedures for the RELIANCE 4-Front Study (i.e. should not cause additional or missed visits);

Annotated entities:
- Context_Error: "Schedule of procedures for the RELIANCE 4-Front Study (i.e. should not cause additional or missed visits);"
- Non-query-able: "Schedule of procedures for the RELIANCE 4-Front Study (i.e. should not cause additional or missed visits);"